一位年輕病人剛受到胸部外傷，經救護車在事故十分鐘後送來急診室，理學檢查發現患者意識清楚可是呼吸急快，頸部靜脈怒張，不會因深呼吸而塌陷，兩側均有清楚呼吸音，護士告知血壓只有 80/65 mmHg，脈搏為 150 次/分，下列診斷，何者是最正確答案？
A. 心包填塞（cardiac tamponade）
B. 張力性氣胸（tension pneumothorax）
C. 早期低血容性休克（hypovolemic shock）
D. 神經性休克（neurogenic shock）

正確答案：A. 心包填塞（cardiac tamponade）